HIV

The above is a clinical trial exclusion criterion. Annotated with entity spans:
[Condition: HIV]